競爭型抑制劑（competitive inhibitor）會對酵素催化反應之動力學參數，產生何種影響？
A. Vmax降低
B. Km值降低
C. Vmax／Km值降低
D. Km值不變

正確答案：C. Vmax／Km值降低